Presence of arrhythmia (including atrial fibrillation, atrial flutter, or 2nd or 3rd degree atrioventricular block)

The above is a clinical trial exclusion criterion. Annotated with entity spans:
Presence of [Condition: arrhythmia] (including [Condition: atrial fibrillation], [Condition: atrial flutter], or [Condition: 2nd] or [Condition: 3rd degree atrioventricular block])